Clinical trial exclusion criterion:
pregnancy or baby nursing period or un-contracepted child bearing period woman.

Entity relations:
- Has_negation("contracepted", "un-")
- AND("child bearing period", "contracepted")
- OR("pregnancy", "baby nursing period", "child bearing period")